¿Cuál de las siguientes terapias fue desarrollada para la prevención de las recaídas depresivas en pacientes recuperados de uno o varios episodios graves de depresión?:
1. La terapia de aceptación y compromiso.
2. La psicoterapia analítica-funcional.
3. Sistema de análisis cognitivo-conductual de psicoterapia.
4. Terapia cognitiva de la depresión basada en la conciencia plena.

Respuesta correcta: 4. Terapia cognitiva de la depresión basada en la conciencia plena.